下列那一種分子在人類所有具有細胞核的細胞中都會表現？
A. IL-1
B. IL-2
C. MHC-I
D. MHC-II

正確答案：C. MHC-I